6. Current malignancy or history of a prior malignancy

The above is a clinical trial exclusion criterion. Annotated with entity spans:
[Parsing_Error: 6.] [Temporal: Current] [Condition: malignancy] or [Temporal: history of a prior] [Condition: malignancy]